Clinical trial inclusion criterion:
ECOG (Eastern Cooperative Oncology Group)score: 0-2

Entity relations:
- Has_value("ECOG (Eastern Cooperative Oncology Group)score", "0-2")